Clinical trial exclusion criterion:
Wound manipulation

Annotated entities:
- Observation: "Wound manipulation"